Infants who have already received postnatal vitamin D supplementation

The above is a clinical trial exclusion criterion. Annotated with entity spans:
[Person: Infants] who have already received [Procedure: postnatal vitamin D supplementation]